以下有關肝斑（chloasma , melasma）的敘述，何者為非？
A. 主要發生於顏面的對稱性色素斑
B. 肝功能異常者常見
C. 口服避孕藥為可能病因之一
D. 患病期間應避免陽光照射

正確答案：B. 肝功能異常者常見